Clinical trial inclusion criterion:
Viable tumor resection confirmed by two highly qualified surgical doctors;

Annotated entities:
- Subjective_judgement: "Viable tumor resection confirmed by two highly qualified surgical doctors"